2. active infection at site of planned block

The above is a clinical trial exclusion criterion. Annotated with entity spans:
[Non-query-able: 2. active infection at site of planned block]